previous lower abdominal surgery with an abnormal micturition

The above is a clinical trial exclusion criterion. Annotated with entity spans:
previous [Procedure: lower abdominal surgery] with an [Qualifier: abnormal] [Condition: micturition]